56 歲男性因噁心、食慾不佳一週，至急診處就診。病人無糖尿病史。生化檢查發現 BUN 118 mg/dL，肌酸酐 8.1 mg/dL。有關此病人是急性或慢性腎衰竭的診斷，下列那一項比較不具鑑別診斷參考價值？
A. 腎臟超音波顯示右側腎臟最長徑 10.3 公分，左側 10.5 公分
B. 病人的血紅素為 13.5 g/dL
C. 病人的血壓為 170/95 mmHg
D. 病人的血清鈣 13.0 mg/dL，磷離子 6.0 mg/dL

正確答案：C. 病人的血壓為 170/95 mmHg